A diferencia de otras fobias, la fobia a la sangre y a las heridas se caracteriza por la presencia de sensación de mareo y, en ocasiones, desmayo ¿A qué se deben estas respuestas?:
1. A un patrón de respuesta bifásico caracterizado por un aumento del ritmo cardiaco y la presión arterial, seguido de una desaceleración vasovagal del ritmo cardiaco y una disminución de la presión arterial.
2. A un patrón de respuesta bifásico caracterizado por una disminución del ritmo cardiaco y la presión arterial, seguida de una aceleración simpática del ritmo cardiaco y aumento de la presiona arterial.
3. A un patrón de respuesta unifásico caracterizado por un aumento del ritmo cardiaco y la presión arterial.
4. A un patrón de respuesta unifásico caracterizado por una disminución del ritmo cardiaco y de la presión arterial.

Respuesta correcta: 1. A un patrón de respuesta bifásico caracterizado por un aumento del ritmo cardiaco y la presión arterial, seguido de una desaceleración vasovagal del ritmo cardiaco y una disminución de la presión arterial.